Clinical trial inclusion criterion:
a very high cardiovascular risk and LDL-cholesterol> 1.8 mmol / l

Entity relations:
- Has_value("LDL-cholesterol", "> 1.8 mmol / l")
- Has_qualifier("cardiovascular risk", "very high")
- AND("cardiovascular risk", "LDL-cholesterol")